Clinical trial inclusion criterion:
age > 18 years

Annotated entities:
- Person: "age"
- Value: "> 18 years"